Clinical trial inclusion criterion:
Non-hematologic laboratory values as outlined in the protocol

Annotated entities:
- Context_Error: "Non-hematologic laboratory values as outlined in the protocol"
- Non-representable: "Non-hematologic laboratory values as outlined in the protocol"